Allergy to ascorbic acid

The above is a clinical trial exclusion criterion. Annotated with entity spans:
[Condition: Allergy] to [Drug: ascorbic acid]